Clinical trial exclusion criterion:
AJCC Stage III or greater

Annotated entities:
- Measurement: "AJCC"
- Value: "Stage III or greater"